憋尿時，人體主要利用下列何種機制？
A. 腎神經抑制膀胱逼尿肌收縮
B. 交感神經刺激尿道外括約肌收縮
C. 副交感神經抑制膀胱逼尿肌收縮
D. 會陰神經（pudendal nerve）刺激尿道外括約肌收縮

正確答案：D. 會陰神經（pudendal nerve）刺激尿道外括約肌收縮